Clinical trial inclusion criterion:
Women of child-bearing potential and men must agree to use 2 forms of adequate contraception prior to study entry and for the duration of study participation

Entity relations:
- Has_qualifier("contraception", "adequate")
- Has_multiplier("contraception", "2 forms")
- Has_mood("contraception", "must agree to")
- AND("Women", "child-bearing potential")
- AND("Women", "contraception")
- multi("for the duration of study participation", "study participation")
- multi("prior to study entry", "study entry")
- Has_temporal("contraception", "prior to study entry")
- Has_temporal("contraception", "for the duration of study participation")
- OR("Women", "men")